El número de pares de cromosomas metacéntricos del cariotipo humano es:
1. 8.
2. 6.
3. 4.
4. 12.
5. 2.

Respuesta correcta: 3. 4.